Scheduled to undergo revision total knee arthroplasty

The above is a clinical trial inclusion criterion. Annotated with entity spans:
Scheduled to undergo [Procedure: revision total knee arthroplasty]